Clinical trial inclusion criterion:
Body mass index (BMI) less than or equal to 32

Entity relations:
- Has_value("Body mass index (BMI)", "less than or equal to 32")